Clinical trial exclusion criterion:
Receipt of live-virus vaccines within 28 days prior to the initiation of study treatment or need for live-virus vaccines at any time during study treatment.

Annotated entities:
- Drug: "live-virus vaccines"
- Temporal: "within 28 days prior"
- Reference_point: "the initiation of study treatment"
- Non-query-able: "need for"
- Drug: "live-virus vaccines"
- Temporal: "any time during"
- Reference_point: "study treatment"
- Observation: "need for"